6. Subject/Caregiver is unable to provide consent.

The above is a clinical trial exclusion criterion. Annotated with entity spans:
[Parsing_Error: 6.] [Non-query-able: Subject/Caregiver is unable to provide consent.]